Clinical trial inclusion criterion:
pelvic pain or pelvic pressure

Annotated entities:
- Condition: "pelvic pain"
- Condition: "pelvic pressure"